How are topologically associating domains (TAD) associated with replication timing?

Topologically associating domains are stable units of replication-timing regulation. Both TADs and their long-range contacts are established during early G1 coincident with the establishment of the replication-timing program. Early and late replication correlate, respectively, with open and closed three-dimensional chromatin compartments identified by high-resolution chromosome conformation capture (Hi-C), and, to a lesser extent, late replication correlates with lamina-associated domains (LADs).